Clinical trial exclusion criterion:
The use of weight-lowering drugs, any investigational blood-glucose or lipid-lowering agent (other than statins or ezetimibe) within the past 3 months

Annotated entities:
- Qualifier: "weight-lowering"
- Drug: "drugs"
- Qualifier: "investigational"
- Qualifier: "lipid-lowering"
- Qualifier: "blood-glucose"
- Drug: "agent"
- Temporal: "past 3 months"
- Negation: "other"
- Drug: "statins"
- Drug: "ezetimibe"